Person is >18 years old.

The above is a clinical trial inclusion criterion. Annotated with entity spans:
Person is [Value: >18 years] [Person: old].